Primary diagnosis of MDD with psychotic feature, bipolar disorder, schizophrenia, schizoaffective disorder, other psychotic disorder or anxiety disorder, a history of alcohol/ drug abuse within the past 12 months, or a diagnosis of dementia

The above is a clinical trial exclusion criterion. Annotated with entity spans:
Primary diagnosis of [Condition: MDD] with [Condition: psychotic feature], [Condition: bipolar disorder], [Condition: schizophrenia], [Condition: schizoaffective disorder], [Qualifier: other] [Condition: psychotic disorder] or [Condition: anxiety disorder,] a history of [Condition: alcohol]/ [Condition: drug abuse] [Temporal: within the past 12 months], or a diagnosis of [Condition: dementia]